Clinical trial exclusion criterion:
Unability to give informed consent

Entity relations:
- Has_negation("give informed consent", "Unability to")